colorectal cancer above to 12 cm from the anal verge

The above is a clinical trial inclusion criterion. Annotated with entity spans:
[Condition: colorectal cancer] [Qualifier: above to 12 cm from the anal verge]